Clinical trial exclusion criterion:
allergy to constituents in Xenbilox (capsules with chenodeoxycholic acid)

Entity relations:
- Subsumes("constituents in Xenbilox", "chenodeoxycholic acid")
- AND("allergy", "constituents in Xenbilox")